Clinical trial exclusion criterion:
Osteoarticular lesion which contraindicates part of the rehabilitation involved in the study.

Annotated entities:
- Condition: "Osteoarticular lesion"
- Non-query-able: "Osteoarticular lesion which contraindicates part of the rehabilitation involved in the study"